Discrimina el tono de un sonido:
1. Las características de la membrana basilar.
2. La amplitud del potencial de acción.
3. El desplazamiento de los cilios.
4. La frecuencia de impulsos nerviosos.

Respuesta correcta: 1. Las características de la membrana basilar.